Clinical trial exclusion criterion:
Airway or thoracic malformation

Annotated entities:
- Condition: "thoracic malformation"
- Condition: "Airway malformation"